Clinical trial inclusion criterion:
7. Have a ventilation-perfusion scan that rules out thromboembolic disease.

Annotated entities:
- Parsing_Error: "7."
- Procedure: "ventilation-perfusion scan"
- Condition: "thromboembolic disease"
- Negation: "rules out"